Clinical trial exclusion criterion:
Babies who have received phenobarbitone or any other anticonvulsive medication before hospitalization

Annotated entities:
- Person: "Babies"
- Drug: "phenobarbitone"
- Qualifier: "any other"
- Drug: "anticonvulsive medication"
- Temporal: "before hospitalization"
- Procedure: "hospitalization"
- Reference_point: "hospitalization"